一名3歲15公斤的男童從6層樓跌落送來急診，生命徵象為心跳160下／分、血壓70/30 mmHg、呼吸30下／分，適當的急救輸液給法為何？
A. 血漿替代液（Gelofusine）一次300毫升快速滴注，給與一次後若沒有反應即輸血
B. 新鮮冷凍血漿（fresh frozen plasma）一次300毫升快速滴注，給與一次後若沒有反應即輸紅血球濃厚液
C. 林格氏液（Ringer's solution）一次150毫升快速滴注，給與兩次後若沒有反應即輸血
D. 生理食鹽水（normal saline）一次300毫升快速滴注，給與兩次後若沒有反應即輸血

正確答案：D. 生理食鹽水（normal saline）一次300毫升快速滴注，給與兩次後若沒有反應即輸血